Clinical trial exclusion criterion:
Target lesion located in the left main stem

Entity relations:
- Has_qualifier("Target lesion", "left main stem")